一位媽媽帶著她 6 個月大的男嬰來到兒科急診，主訴這位男嬰自從生下來後，已有 10 次中耳炎發作及 2 次因肺炎住院之過去病史，理學檢查時，發現男嬰身上有多處瘀青（bruises），四肢也有多處濕疹（eczema）。這位男嬰可能之診斷是：
A. Ataxia-telangectasia
B. Wiskott-Aldrich syndrome
C. X-linked agammaglobulinemia
D. Combined variable immunodeficiency

正確答案：B. Wiskott-Aldrich syndrome